Clinical trial inclusion criterion:
Platelet count ≥ 75,000/mcL

Annotated entities:
- Measurement: "Platelet count"
- Value: "≥ 75,000/mcL"